Clinical trial exclusion criterion:
Drug abuser.

Annotated entities:
- Condition: "Drug abuser"